Clinical trial inclusion criterion:
For melanoma patients, If patients have a history of malignancy other than melanoma, and other skin cancers in the past five years, their inclusion is up to the discretion of the physician.

Annotated entities:
- Condition: "melanoma"
- Condition: "malignancy"
- Condition: "melanoma"
- Negation: "other than"
- Condition: "skin cancers"
- Temporal: "in the past five years"
- Subjective_judgement: "up to the discretion of the physician"
- Grammar_Error: "and"
- Temporal: "history"